Clinical trial inclusion criterion:
Aged =18 years

Entity relations:
- Has_value("Aged", "=18 years")